61 歲男性。近兩年來每天清晨起床會頭痛，白天常昏昏欲睡，晚上鼾聲大作。近來更有高血壓與呼吸困難等症狀。體重三年來增加 10 公斤。睡眠多項生理檢查顯示，病人每小時有 15~20 次阻塞性呼 吸中止，伴隨有血氧飽和度降低，最低值達 72%。下列何者為最適當且有效的處置？
A. 每天睡眠時經 nasal cannula 給予氧氣治療
B. 手術治療（懸壅垂軟顎整形手術）有長期療效
C. 鼻罩式陽壓呼吸器（nasal CPAP）為目前效果最持久的治療方法
D. 給予安眠藥

正確答案：C. 鼻罩式陽壓呼吸器（nasal CPAP）為目前效果最持久的治療方法